Allergy to any of proposed medications

The above is a clinical trial exclusion criterion. Annotated with entity spans:
[Condition: Allergy] to any of [Drug: proposed medications]